5. Be on stable dose of at least one of the following PAH-specific therapies: endothelin receptor antagonist, an agent acting on the nitric oxide pathway (phosphodiesterase type 5 inhibitor or soluble guanylate cyclase stimulator), and/or a prostacyclin or prostacyclin analog.

The above is a clinical trial inclusion criterion. Annotated with entity spans:
[Parsing_Error: 5.] Be on [Qualifier: stable dose] of [Multiplier: at least one] of the following [Procedure: PAH-specific therapies]: [Drug: endothelin receptor antagonist], an [Drug: agent acting on the nitric oxide pathway] ([Drug: phosphodiesterase type 5 inhibitor] or [Drug: soluble guanylate cyclase stimulator]), and/or a [Drug: prostacyclin] or [Drug: prostacyclin analog].